Which is the primary distinction between the Reverse Warburg effect and the conventional Warburg effect?

The conventional "Warburg effect" reffers to  the metabolic shift of cancer cells towards aerobic glycolysis, due to mitochondrial dysfunction. The "reverse Warburg effect" or "parasitic" energy-transfer, is a model of "two-compartment tumor metabolism". In this model, cancer cells secrete hydrogen peroxide (H2O2), initiating oxidative stress and aerobic glycolysis in the tumor stroma. The cancer-associated fibroblasts of the stroma are glycolytic and lack detectable mitochondria. These glycolytic stromal cells produce mitochondrial fuels (L-lactate, ketone bodies and chemical building blocks, such as amino acids -glutamine-, and nucleotides) that are then transferred to oxidative epithelial cancer cells. Lactate and ketones drive cancer cell  oxidative mitochondrial metabolism (OXPHOS), and building blocks sustain the anabolic needs of rapidly proliferating cancer cells. Therefore, according to the "reverse Warburg effect", stromal catabolism fuels anabolic tumor growth via energy transfer. Thus, in "reverse Warburg effect" the cancer-associated fibroblasts of the stroma undergo aerobic glycolysis, rather than epithelial cancer cells themselves, as proposed by the conventional "Warburg effect".